Clinical trial exclusion criterion:
severe valve disease requiring valve replacement

Entity relations:
- multi("requiring valve replacement", "valve replacement")
- Has_qualifier("valve disease", "severe")
- Has_qualifier("valve disease", "requiring valve replacement")